Clinical trial inclusion criterion:
Age > 18 years old

Entity relations:
- Has_value("Age", "> 18 years old")